Patients aged =50 years with DM2 and symptomatic PAD diagnosed clinically (according to Fontaine criteria, stage IIa or IIb and III) and by measuring the <U+0391><U+0392><U+0399>.

The above is a clinical trial inclusion criterion. Annotated with entity spans:
Patients [Person: aged] [Value: =50 years] with [Condition: DM2] and [Qualifier: symptomatic] [Condition: PAD] diagnosed clinically (according to [Measurement: Fontaine criteria], [Value: stage IIa or IIb and III]) and [Non-representable: by measuring the <U+0391><U+0392><U+0399>].